腦脊髓液（cerebrospinal fluid）由何者分泌生成？
A. 海綿竇（cavernous sinus）
B. 蛛網膜顆粒（arachnoid granulations）
C. 脈絡叢（choroid plexus）
D. 脈絡膜（choroid）

正確答案：C. 脈絡叢（choroid plexus）